腹部手術後造成小腸沾黏阻塞時，下列敘述何者錯誤？
A. 上消化道鋇劑攝影是必須的，以確定阻塞位置
B. 鼻胃管減壓及禁食是有需要的
C. 補充體液及電解質是有需要的
D. 腹部 X 光攝影，有時須反覆檢查

正確答案：A. 上消化道鋇劑攝影是必須的，以確定阻塞位置